Clinical trial exclusion criterion:
Fasting glucose = 126 mg/dL on 2 occasions during screening indicating need for prompt treatment;

Annotated entities:
- Measurement: "Fasting glucose"
- Value: "= 126 mg/dL"
- Multiplier: "2 o"